Clinical trial inclusion criterion:
Both males and females.

Annotated entities:
- Person: "males"
- Person: "females"